Known bigemini/trigeminy

The above is a clinical trial exclusion criterion. Annotated with entity spans:
Known [Condition: bigemini]/[Condition: trigeminy]